NYHA III:Marked limitation of physical activity. Comfortable at rest, but less than ordinary activity causes undue breathlessness, fatigue or palpitation.

The above is a clinical trial inclusion criterion. Annotated with entity spans:
[Non-query-able: NYHA III:Marked limitation of physical activity. Comfortable at rest, but less than ordinary activity causes undue breathlessness, fatigue or palpitation].